Clinical trial exclusion criterion:
serious bleeding during the course of the ulcer

Entity relations:
- Has_qualifier("bleeding", "serious")
- Has_temporal("bleeding", "during the course of the ulcer")